Clinical trial exclusion criterion:
19. Subject with previous history of tumor, or current tumor patient, or subject with pre-cancerous disease manifested by pathological examination (such as ductal carcinoma in situ or cervical epithelial dysplasia)

Annotated entities:
- Condition: "tumor"
- Temporal: "previous history"
- Condition: "tumor"
- Temporal: "current"
- Condition: "pre-cancerous disease"
- Procedure: "pathological examination"
- Condition: "ductal carcinoma in situ"
- Condition: "cervical epithelial dysplasia"